Clinical trial exclusion criterion:
Contraindications according to summary of product characteristics of investigational test and reference product

Annotated entities:
- Non-representable: "Contraindications according to summary of product characteristics of investigational test and reference product"